一位 65 歲女性是長期糖尿病患者，因念珠菌血症（Candidemia）住院治療，血液培養證實感染之病原為白色念珠菌（Candida albicans）。經以靜脈注射投予 Fluconazole 二星期，血液培養呈陰性反應，病情也獲得控制後出院。但再經二星期，同樣的感染再度發生，在同時考慮這位患者之腎功能（creatinine 指數 1.3 mg/dL），最可能進一步治療之方式為何？
A. 繼續投予 Fluconazole 同時提高劑量
B. 改投予 Amphotericin B 合併 Flucytosine
C. 改投予 Caspofungin
D. 改投予 Ketoconazole

正確答案：C. 改投予 Caspofungin